mitoxantrone,

The above is a clinical trial exclusion criterion. Annotated with entity spans:
[Drug: mitoxantrone],